Clinical trial inclusion criterion:
Age ≥ 18 years old

Entity relations:
- Has_value("Age", "≥ 18 years old")